Clinical trial exclusion criterion:
Concern for inability of the patient to comply with study procedures and/or follow up (eg, alcohol or drug abuse)

Entity relations:
- Has_mood("inability to comply with study procedures", "Concern for")
- AND("inability to comply with study procedures", "alcohol abuse")
- OR("inability to comply with study procedures", "inability to comply with follow up")
- OR("alcohol abuse", "drug abuse")